History of a severe allergic reaction (e.g. anaphylaxis) to any component of the vaccines used in the study including neomycin, yeast and polymyxin B

The above is a clinical trial exclusion criterion. Annotated with entity spans:
History of a [Qualifier: severe] [Condition: allergic reaction] (e.g. [Condition: anaphylaxis]) to any [Drug: component of the vaccines used in the study] including [Drug: neomycin], [Drug: yeast] and [Drug: polymyxin B]